Clinical trial exclusion criterion:
Established ischemic heart disease, peripheral arterial disease and/or cerebrovascular disease.

Entity relations:
- OR("ischemic heart disease", "cerebrovascular disease", "peripheral arterial disease")